Clinical trial exclusion criterion:
pregnant or nursing woman

Entity relations:
- OR("pregnant", "nursing")